La reacción de la cetonas y los aldehídos por la presencia de su grupo carbonilo dan preferentemente:
1. Reacciones de sustitución nucleofílica.
2. Reacciones de oxidación hasta alcoholes.
3. Reacciones de adición nucleofílica.
4. Reacciones de reducción hasta ácidos carboxílicos.
5. No son reactivos frente a nucleófilos.

Respuesta correcta: 3. Reacciones de adición nucleofílica.